El potencial de acción se inicia en la membrana del segmento inicial del axón por:
1. Ser el lugar donde se produce la sinapsis.
2. Tener un umbral de excitación mayor.
3. Presentar alta concentración de canales dependientes de voltaje.
4. Presentar canales de Na+ regulados por ligando
5. Empezar allí la vaina de mielina del axón.

Respuesta correcta: 3. Presentar alta concentración de canales dependientes de voltaje.